History of severe related adverse event(s) from previous participation in VA-001 or VA-006 trials or to any smallpox vaccination.

The above is a clinical trial exclusion criterion. Annotated with entity spans:
History of severe related [Condition: adverse event](s) from [Undefined_semantics: previous participation in VA-001 or VA-006 trials] or to any [Procedure: smallpox vaccination].